Non-English speaking parents/patients.

The above is a clinical trial exclusion criterion. Annotated with entity spans:
[Observation: Non-English speaking parents]/patients.